一位 20 歲男性在經過一次類似流行性感冒的疾病後，呈現血尿及輕微的蛋白尿但腎臟功能仍維持正常。血清裡 C3 和 C4 並未下降。腎臟生檢展現腎絲球膈細胞增生（mesangial cell proliferation）及免疫複合體沉積於腎絲球膈部。下列腎病中何者是最可能的病理診斷？
A. Membranous glomerulonephritis
B. Minimal change nephropathy
C. IgA nephropathy
D. Membranoproliferative glomerulonephritis

正確答案：C. IgA nephropathy